Clinical trial inclusion criterion:
ASA I and II women

Annotated entities:
- Measurement: "ASA"
- Value: "I and II"
- Person: "women"